Any phosphodiesterase 5 inhibitor (sildenafil, tadalafil, avanafil, vardenafil) has been taken within 72 hours prior to the study.

The above is a clinical trial exclusion criterion. Annotated with entity spans:
Any [Drug: phosphodiesterase 5 inhibitor] ([Drug: sildenafil], [Drug: tadalafil], [Drug: avanafil], [Drug: vardenafil]) has been taken [Temporal: within 72 hours prior to the study].